Which type of cancer has been suggested as a strategy for potential small-molecule inhibition of METTL3?

Small-molecule inhibition of METTL3 as a strategy against myeloid leukaemia.